Surgery intent within 4 weeks

The above is a clinical trial inclusion criterion. Annotated with entity spans:
[Procedure: Surgery] [Mood: intent] [Temporal: within 4 weeks]